下列延長動作電位之抗心律不整藥物，何者誘發Torsade de Pointes之心室心律不整機率最小？
A. Procainamide
B. Quinidine
C. Ibutilide
D. Amiodarone

正確答案：D. Amiodarone